What is Dravet syndrome?

dravet syndrome is one of the most severe epilepsy syndromes of early childhood, and it comes with very high morbidity and mortality.